Y 染色體那部分的基因缺損會造成男性精蟲活動力不良？
A. p arm
B. q arm
C. p arm 和 q arm
D. centromere

正確答案：B. q arm